Clinical trial inclusion criterion:
OR any FEV1 with chronic hypercapnia (baseline partial pressure of arterial carbon dioxide [PaCO2] > 45)

Entity relations:
- Subsumes("partial pressure of arterial carbon dioxide", "PaCO2")
- Has_value("partial pressure of arterial carbon dioxide", "> 45")